當尿液中X之濃度為36 mg/mL，血漿中X之濃度為0.25 mg/mL，若受測者尿量為1 mL/min，血比容（hematocrit）為50%，則X的血漿清除率（clearance）最接近多少mL/min？
A. 9
B. 18
C. 144
D. 288

正確答案：C. 144